Los Cinco Grandes son dimensiones del funcionamiento personal que se han obtenido del análisis de:
1. La conducta registrada en el laboratorio.
2. Los polimorfismos genéticos del individuo.
3. El lenguaje común presente en el diccionario.
4. La observación en el contexto clínico.
5. El funcionamiento eléctrico del Sistema Nervioso.

Respuesta correcta: 3. El lenguaje común presente en el diccionario.